Clinical trial exclusion criterion:
Current intake of antibiotics or end of antibiotic therapy <8 days before first IMP administration

Entity relations:
- Has_index("<8 days before first IMP administration", "first IMP administration")
- Has_temporal("antibiotic therapy", "<8 days before first IMP administration")
- Has_multiplier("antibiotic therapy", "end of")
- Has_temporal("antibiotics", "Current")
- OR("antibiotics", "antibiotic therapy")